What are the key characteristics of the syndrome caused by ANKRD17 loss-of-function variants?

Heterozygous ANKRD17 loss-of-function variants cause a syndrome with intellectual disability, speech delay, and dysmorphia.